3. self-reported AT-related pain for at least 6 months and VAS (Visual Analog Scale) pain >5 (0-10 scale)

The above is a clinical trial inclusion criterion. Annotated with entity spans:
3. [Observation: self-reported] [Condition: AT-related pain] [Temporal: for at least 6 months] and [Measurement: VAS (Visual Analog Scale) pain] [Value: >5] ([Qualifier: 0-10 scale])